Clinical trial exclusion criterion:
2. Unable to consent to the study.

Annotated entities:
- Post-eligibility: "Unable to consent to the study."
- Non-query-able: "Unable to consent to the study."